Pregnant woman or breastfeeding

The above is a clinical trial exclusion criterion. Annotated with entity spans:
[Condition: Pregnant] [Person: woman] or [Observation: breastfeeding]